Rb 和 p53 基因在致癌機轉中在細胞繁殖週期（cell cycle）何處扮演關鍵性的角色？
A. G0至 G1間
B. G2至 M 間
C. G1至 S 間
D. S 至 G2間

正確答案：C. G1至 S 間